Clinical trial exclusion criterion:
1. Prior exposure to doxorubicin, PLD or any other anthracycline, motolimod and other TLR agonists, MEDI4736 or checkpoint inhibitors, such as anti-CTLA4 and anti-PD1/anti-PD-L1 antibodies.

Entity relations:
- Subsumes("checkpoint inhibitors", "anti-CTLA4")
- Has_temporal("doxorubicin", "Prior")
- Subsumes("checkpoint inhibitors", "and")
- OR("anti-CTLA4", "anti-PD1 antibodies", "anti-PD-L1 antibodies")
- OR("doxorubicin", "MEDI4736", "TLR agonists", "motolimod", "anthracycline", "PLD", "checkpoint inhibitors")